What is the function of the ISW1 and CHD1 remodellers in yeast chromatin?

eviction of h1